Clinical trial exclusion criterion:
Women who are less than 6 weeks postpartum

Annotated entities:
- Person: "Women"
- Temporal: "less than 6 weeks postpartum"
- Reference_point: "postpartum"